Clinical trial exclusion criterion:
Cardiac dysrhythmia precluding treatment with domperidone or apomorphine (increased QTc = 440 ms in men, QTc = 450 ms in women)

Annotated entities:
- Condition: "Cardiac dysrhythmia"
- Drug: "domperidone"
- Drug: "apomorphine"
- Negation: "precluding"
- Measurement: "QTc"
- Value: "= 440 ms"
- Measurement: "QTc"
- Value: "= 450 ms"
- Person: "women"
- Person: "men"